Clinical trial exclusion criterion:
Weight loss drugs other than metformin

Annotated entities:
- Observation: "Weight loss"
- Negation: "other"
- Drug: "metformin"